Clinical trial exclusion criterion:
Renal failure on dialysis

Annotated entities:
- Condition: "Renal failure"
- Procedure: "dialysis"